Clinical trial inclusion criterion:
Subjects aged 18 to 80 years old

Annotated entities:
- Value: "18 to 80 years old"
- Person: "aged"